世界醫學會（World Medical Association）所制定的赫爾辛基宣言（Declaration of Helsinki）中，對研究風險的認知，下列何者正確？
A. 主要的危險與醫療責任多發生在治療程序中，預防及診斷不太可能發生危險與醫療責任
B. 主要的危險與醫療責任多發生在治療及預防程序中，診斷不太可能發生危險與醫療責任
C. 大多數的預防、診斷及治療程序都涉及一定的危險與醫療責任
D. 以治療為目的的研究風險較高，非以治療為目的的研究風險較低

正確答案：C. 大多數的預防、診斷及治療程序都涉及一定的危險與醫療責任